慢性阻塞性肺病產生急性惡化（acute exacerbation），咳嗽有黃痰，呼吸每分鐘 18 次；下列治療之敘述，何者非絕對必需？
A. 抗生素
B. 類固醇
C. 支氣管擴張劑
D. 人工呼吸器

正確答案：D. 人工呼吸器